Which was the first adeno-associated virus vector gene therapy product approved in the United States?

The first adeno-associated virus vector gene therapy product in the United States was Luxturna.